Clinical trial exclusion criterion:
Stage 4 or 5 chronic kidney disease (eGFR< 30ml/min/1.73m2),

Annotated entities:
- Condition: "chronic kidney disease"
- Qualifier: "Stage 4 or 5"
- Measurement: "eGFR"
- Value: "< 30ml/min/1.73m2"